What is the role of the IRE1a-XBP1 pathway?

The IRE1a-XBP1 pathway is a conserved adaptive mediator of the unfolded protein response, playing an important role in the regulation of cell differentiation.